下列那一個運輸系統屬於P-type ATPase 的作用機制？
A. 肌肉細胞內質網的鈣離子幫浦（Ca2+ pump）
B. 紅血球上的葡萄糖運輸器（glucose transporter）
C. 小腸黏膜細胞內的鈉離子-葡萄糖運輸器（Na+-glucose transporter）
D. 紅血球上的氯離子-碳酸氫鹽交換器（chloride-bicarbonate exchanger）

正確答案：A. 肌肉細胞內質網的鈣離子幫浦（Ca2+ pump）